Clinical trial inclusion criterion:
Miller class 1, 2 and 3 recession defects will be included

Annotated entities:
- Measurement: "Miller"
- Condition: "recession defects"
- Value: "class 1, 2 and 3"